Clinical trial exclusion criterion:
inability to obtain valid data from

Annotated entities:
- Non-query-able: "inability to obtain valid data from"